Clinical trial exclusion criterion:
Subjects who based on history or mental status examination have a significant risk of committing suicide, in the investigator's opinion.

Entity relations:
- Has_qualifier("risk of committing suicide", "significant")